Inability or unwillingness to comply with the treatment protocol, follow-up, or research tests.

The above is a clinical trial exclusion criterion. Annotated with entity spans:
[Condition: Inability] or [Observation: unwillingness] to [Informed_consent: comply with the treatment protocol], [Procedure: follow-up], or [Post-eligibility: research tests].